What percentage of C. elegans genes reside in operons?

Nearly 15% of the ~20,000 C. elegans genes are contained in operons, multigene clusters controlled by a single promoter. Both methods indicate that the pre-mRNAs of about 70% of Caenorhabditis elegans  genes are trans-spliced and as many as a quarter are transcribed in these operons.